Intraretinal edema on OCT;

The above is a clinical trial exclusion criterion. Annotated with entity spans:
[Condition: Intraretinal edema] on [Procedure: OCT];